According multidisciplinary (heart) team decision TAVI is preferable,

The above is a clinical trial inclusion criterion. Annotated with entity spans:
[Non-representable: According multidisciplinary (heart) team decision TAVI is preferable,]